Clinical trial exclusion criterion:
Current or past history of aspirin-induced asthma or hypersensitivity to NSAIDs.

Annotated entities:
- Qualifier: "aspirin-induced"
- Drug: "aspirin"
- Condition: "asthma"
- Condition: "hypersensitivity to NSAIDs"
- Drug: "NSAIDs"
- Temporal: "past history"
- Temporal: "Current"